histologically confirmed metastatic cancer that is not amenable to surgery or radiation therapy with curative intent

The above is a clinical trial inclusion criterion. Annotated with entity spans:
[Measurement: histologically] [Value: confirmed] [Condition: metastatic cancer] that is [Qualifier: not amenable] to [Procedure: surgery] or [Procedure: radiation therapy] with curative intent